5. ECOG performance status of 0 or 1.

The above is a clinical trial inclusion criterion. Annotated with entity spans:
[Parsing_Error: 5.] [Measurement: ECOG performance status] of [Value: 0 or 1].